一位 58 歲女性病人之血清中鐵（iron）及全鐵質結合能力（total iron-binding capacity, TIBC）兩者之值均較低，但含鐵蛋白（ferritin）較高。下列何者為可能的原因？
A. 慢性病引起之貧血
B. 自體免疫溶血性貧血
C. 維生素B12缺乏
D. 缺鐵性貧血

正確答案：A. 慢性病引起之貧血